Clinical trial inclusion criterion:
patients undergoing invasive procedures via the radial or femoral arteries

Entity relations:
- Has_temporal("invasive procedures", "undergoing")
- Has_qualifier("invasive procedures", "radial arteries")
- OR("radial arteries", "femoral arteries")